Subjects who have been recently active (>30 min of moderate/high intensity exercise, 2 times/week).

The above is a clinical trial exclusion criterion. Annotated with entity spans:
Subjects who have been [Temporal: recently] [Condition: active] ([Value: >30 min] of [Measurement: moderate/high intensity exercise], [Multiplier: 2 times/week]).